下列那一種胺基酸是腸黏膜細胞（enterocytes）之能量來源？
A. histidine
B. glutamine
C. valine
D. alanine

正確答案：B. glutamine